Clinical trial inclusion criterion:
Diagnosis of moderate to severe Ankylosing Spondylitis (AS) with prior documented radiologic evidence fulfilling the Modified New York criteria for AS

Entity relations:
- Has_qualifier("Ankylosing Spondylitis (AS)", "moderate")
- Has_temporal("radiologic evidence", "prior")
- multi("radiologic evidence", "radiologic")
- Has_value("Modified New York criteria for AS", "fulfilling")
- AND("radiologic evidence", "Modified New York criteria for AS")
- AND("Ankylosing Spondylitis (AS)", "radiologic evidence")
- OR("moderate", "severe")